Clinical trial inclusion criterion:
6. Ability to follow verbal or visual commands

Entity relations:
- OR("Ability to follow verbal commands", "Ability to follow visual commands")